HIV infection.

The above is a clinical trial exclusion criterion. Annotated with entity spans:
[Condition: HIV infection].